Clinical trial exclusion criterion:
Life expectancy less than 3 months

Annotated entities:
- Observation: "Life expectancy"
- Value: "less than 3 months"